Clinical trial exclusion criterion:
Prior coronary revascularization (PCI or CABG) or myocardial infarction (as evidenced by previously elevated CPK-MB or troponin levels)

Annotated entities:
- Temporal: "Prior"
- Condition: "coronary revascularization"
- Procedure: "PCI"
- Procedure: "CABG"
- Condition: "myocardial infarction"
- Measurement: "CPK-MB levels"
- Measurement: "troponin levels"
- Value: "elevated"
- Temporal: "previously"